Diagnosis or h/o PTSD, depression, substance use, mental health problems, sleep disorders, HPA disruption and/or TBI

The above is a clinical trial exclusion criterion. Annotated with entity spans:
Diagnosis or h/o [Condition: PTSD], [Condition: depression], [Condition: substance use], [Condition: mental health problems], [Condition: sleep disorders], [Condition: HPA disruption] and/or [Condition: TBI]